Previous myocardial infarction, coronary artery intervention, coronary artery bypass surgery, or other cardiac surgery

The above is a clinical trial exclusion criterion. Annotated with entity spans:
[Temporal: Previous] [Condition: myocardial infarction], [Procedure: coronary artery intervention], [Procedure: coronary artery bypass surgery], or [Procedure: other cardiac surgery]